Clinical trial inclusion criterion:
Serum bilirubin ≤1.5 x upper limit of normal (ULN).

Entity relations:
- Has_value("Serum bilirubin", "≤1.5 x upper limit of normal (ULN)")